Clinical trial exclusion criterion:
6. Chest pain lasting longer than 30 minutes within 12 hours pre-procedure, if CK enzymes positive (≥ 2x the normal upper limit).

Entity relations:
- Has_qualifier("Chest pain", "lasting longer than 30 minutes")
- Has_temporal("Chest pain", "within 12 hours pre-procedure")
- Subsumes("positive", "≥ 2x the normal upper limit")
- Has_value("CK enzymes", "positive")
- AND("CK enzymes", "Chest pain")